一位 29 歲男性因急性上腹痛至急診室就診，身體診查顯示病人有上腹壓痛並有輕微反彈痛（rebound tenderness），無黃疸，體溫 37.0°C。血液檢查顯示：WBC：9800/mm3，Hb：16.2 g/dL，ALT（GPT）： 58 U/L（正常值＜40 U/L），AST（GOT）：139 U/L（正常值＜45 U/L），鹼性磷酸酶（alkaline phosphatase）：108 U/L（正常值＜100 U/L），γ-glutamyltransferase（GGT）：380 U/L（正常值＜60 U/L），amylase：785 U/L（正常值＜190 U/L），lipase：859 U/L（正常值＜190 U/L）。請問下列處置何者最不適宜？
A. 宜立即給予抗生素治療
B. 宜安排腹部超音波檢查
C. 宜加強詢問喝酒史與藥物服用史
D. 宜開立禁食之醫囑

正確答案：A. 宜立即給予抗生素治療